Clinical trial inclusion criterion:
On dual or triple antiplatelet therapy and between 12months and 14months from Bioresorbable Vascular Scaffold implantation

Entity relations:
- AND("implantation", "Bioresorbable Vascular Scaffold")
- multi("Bioresorbable Vascular Scaffold implantation", "implantation")
- Has_index("between 12months and 14months from Bioresorbable Vascular Scaffold implantation", "Bioresorbable Vascular Scaffold implantation")
- Has_temporal("dual antiplatelet therapy", "between 12months and 14months from Bioresorbable Vascular Scaffold implantation")
- OR("dual antiplatelet therapy", "triple antiplatelet therapy")